Clinical trial exclusion criterion:
moderate-to-severe depression (> 25 points on the Beck Depression Inventory)

Annotated entities:
- Qualifier: "moderate-to-severe"
- Condition: "depression"
- Value: "> 25 points"
- Measurement: "Beck Depression Inventory"